Body Mass Index (BMI) between 18 <= BMI <= 27 kilogram per meter square (kg/m^2)

The above is a clinical trial inclusion criterion. Annotated with entity spans:
[Measurement: Body Mass Index (BMI)] [Value: between 18 <= BMI <= 27 kilogram per meter square (kg/m^2)]